Cuando la persona únicamente observa la conducta del modelo y aprende su conducta o pautas de acción, sin reproducirla durante la sesión de entrenamiento ¿qué tipo de modelado es?
1. Modelado in vivo.
2. Modelado participante.
3. Modelado simbólico.
4. Modelado pasivo.
5. Modelado de autoinstrucciones.

Respuesta correcta: 4. Modelado pasivo.